Clinical trial inclusion criterion:
Diagnosis of Type 2 Diabetes from at least 3 years;

Entity relations:
- Has_temporal("Type 2 Diabetes", "at least 3 years")